En cromatografía de exclusión molecular:
1. Las moléculas más pequeñas que los poros del empaquetamiento pasan más lentamente que las grandes.
2. Las moléculas más pequeñas que los poros del empaquetamiento pasan más rápidamente que las grandes.
3. El orden de elución no depende del tamaño de los analitos.
4. La elución de los analitos se basa en un mecanismo de reparto.

Respuesta correcta: 1. Las moléculas más pequeñas que los poros del empaquetamiento pasan más lentamente que las grandes.